Men and women 18-89 years old

The above is a clinical trial inclusion criterion. Annotated with entity spans:
[Person: Men] and [Person: women] [Value: 18-89 years] [Person: old]